LTBI diagnosis as per Canadian TB Standards using either the Tuberculin Skin Test (TST) or the Interferon Gamma Release Assay (IGRA)

The above is a clinical trial inclusion criterion. Annotated with entity spans:
[Condition: LTBI] diagnosis as per Canadian TB Standards using either the [Measurement: Tuberculin Skin Test] ([Measurement: TST]) or the [Measurement: Interferon Gamma Release Assay] ([Measurement: IGRA])